La determinación de sangre oculta en heces es útil ante una sospecha de:
1. Anemia por déficit de hierro.
2. Colestasis biliar.
3. Infección por Helicobacter pylori.
4. Carcinoma de colon.
5. Enfermedad celiaca.

Respuesta correcta: 4. Carcinoma de colon.